Clinical trial inclusion criterion:
asthma or COPD

Entity relations:
- OR("asthma", "COPD")